6. Legal blindness or severe visual impairment;

The above is a clinical trial exclusion criterion. Annotated with entity spans:
[Parsing_Error: 6.] [Condition: Legal blindness] or [Condition: severe visual impairment];